33 歲女性 G1P0 妊娠 40 週，待產中胎心率發生「早期減速」（early deceleration），請問下列診斷中何者最為可能？
A. 胎頭壓迫
B. 臍繞頸
C. 臍帶壓迫
D. 胎盤功能不良

正確答案：A. 胎頭壓迫